Clinical trial exclusion criterion:
Recurrent urogenital infections

Annotated entities:
- Multiplier: "Recurrent"
- Condition: "urogenital infections"